Clinical trial inclusion criterion:
forced expiratory volume in 1s : forced vital capacity ratio > 0.75

Entity relations:
- Has_value("forced expiratory volume in 1s : forced vital capacity ratio", "> 0.75")